Planned revascularization within 6 months

The above is a clinical trial exclusion criterion. Annotated with entity spans:
[Mood: Planned] [Procedure: revascularization] [Temporal: within 6 months]